Patients with an on-going agitation episode, or with a previous one within the 6 months prior to screening, attended and managed in the hospital setting.

The above is a clinical trial inclusion criterion. Annotated with entity spans:
Patients with an on-going [Condition: agitation episode], or with a previous one [Temporal: within the 6 months prior to screening], attended and managed in the hospital setting.